Clinical trial exclusion criterion:
History of previous cesarean delivery

Entity relations:
- Has_temporal("cesarean delivery", "previous")
- Has_temporal("cesarean delivery", "History")